下列何者為一種抑制細菌蛋白質合成的抗菌藥物，曾被用來治療Bacteroides fragilis感染所引起的腹部膿腫，但很容易產生結腸炎？
A. Clarithromycin
B. Clindamycin
C. Minocycline
D. Ticarcillin

正確答案：B. Clindamycin